Clinical trial exclusion criterion:
18. Human immunodeficiency virus positivity

Annotated entities:
- Condition: "Human immunodeficiency virus"
- Measurement: "Human immunodeficiency virus"
- Value: "positivity"